La proteína quinasa A (PKA):
1. Induce la síntesis de glucógeno en respuesta a un aumento de glucagón en la sangre.
2. Es una proteína de membrana que se activa en respuesta a un aumento de GTP circulante.
3. Se activa a través del cAMP producido en respuesta a un aumento de adrenalina en la circulación.
4. Inhibe la lipolisis de los triacilglicéridos acumulados en el tejido adiposo, en respuesta a un aumento de cAMP intracelular.
5. Es una proteína monomérica que inhibe la síntesis de ATP y la contracción muscular.

Respuesta correcta: 3. Se activa a través del cAMP producido en respuesta a un aumento de adrenalina en la circulación.